下列何構造是由內胚層細胞衍生而成？
A. 背根神經節
B. 腎上腺髓質
C. 牙齒之琺瑯質
D. 呼吸道之內襯上皮

正確答案：D. 呼吸道之內襯上皮